Clinical trial inclusion criterion:
Biopsy-proven LN Class III/IV±V (ISN/RPS 2003), with biopsy performed within 12 weeks of randomization.

Entity relations:
- Has_qualifier("LN", "Class III/IV±V")
- Has_temporal("biopsy", "within 12 weeks")
- AND("LN", "biopsy")